severe behavioral issues

The above is a clinical trial exclusion criterion. Annotated with entity spans:
[Qualifier: severe] [Condition: behavioral issues]